Clinical trial inclusion criterion:
=1 ill-defined hyperfluorescent leakage areas on fluorescein angiography (FA) with retinal pigment epithelial window defect(s) that are compatible with cCSC;

Annotated entities:
- Multiplier: "=1"
- Qualifier: "ill-defined"
- Condition: "hyperfluorescent leakage areas"
- Procedure: "fluorescein angiography (FA)"
- Condition: "retinal pigment epithelial window defect(s)"
- Non-representable: "that are compatible with cCSC"